下列關於 Staphylococcus aureus 毒素的敘述，那一項錯誤？
A. alpha toxin 可嵌入多種細胞的細胞膜導致細胞因滲透壓改變而溶解
B. beta toxin 是造成 staphylococcal scalded skin syndrome（SSSS）的主因
C. delta toxin 也會在其他 staphylococci 如 Staphylococcus epidermidis 中發現
D. leukocidin 可導致嗜中性白血球的破壞

正確答案：B. beta toxin 是造成 staphylococcal scalded skin syndrome（SSSS）的主因